在神經系統發育中，非源自神經外胚層（neuroectoderm）的是：
A. 許旺氏細胞（Schwann cell）
B. 腎上腺髓質（adrenal medulla）
C. 室管膜（ependyma）
D. 微膠細胞（microglial cell）

正確答案：D. 微膠細胞（microglial cell）